Clinical trial inclusion criterion:
Clinically and angiographically stable CAD who requires CABG as part of the standard medical care, as CAD does not represent a contraindication for using liraglutide. The stability of the CAD further warranties that study patients will not be exposed to higher risk by using liraglutide

Entity relations:
- Has_mood("CABG", "requires")
- Has_qualifier("CAD", "angiographically stable")
- Has_qualifier("CAD", "Clinically stable")